Pregnant women, breast-feeding

The above is a clinical trial exclusion criterion. Annotated with entity spans:
[Condition: Pregnant] [Person: women], [Condition: breast-feeding]